Concurrent use of organic nitrites and nitrates.

The above is a clinical trial exclusion criterion. Annotated with entity spans:
[Temporal: Concurrent] use of [Drug: organic nitrites] and [Drug: nitrates].